ADHD is diagnosed according to Diagnostic and Statistical Manual of Mental Disorders, fifth edition (DSM-5 criteria).

The above is a clinical trial inclusion criterion. Annotated with entity spans:
[Condition: ADHD] is diagnosed according to Diagnostic and Statistical Manual of Mental Disorders, fifth edition ([Qualifier: DSM-5] criteria).